Clinical trial exclusion criterion:
Refusal to sign an informed consent form to participate in this study, and sign the hospital information release form, if applicable

Entity relations:
- Has_context("sign an informed consent form", "Refusal to")
- Has_context("sign the hospital information release form", "Refusal to")
- OR("sign an informed consent form", "sign the hospital information release form")